Which disease is monitored in the BIOCURA cohort?

The BiOCURA registry includes patient with Rheumatoid Arthritis (RA) with the aim of defining their response profile to different RA treatments.